下列何種病毒感染後，在感染部位的抹片檢查可以看到有多核的融合細胞與內涵體 （inclusion body）？
A. Herpes simplex virus
B. Human papillomavirus
C. Adenovirus
D. Epstein-Barr virus

正確答案：A. Herpes simplex virus